Other active inflammatory process (major infection, malignancy, rheumatoid arthritis/autoimmune disorder) within the prior 28 days.

The above is a clinical trial exclusion criterion. Annotated with entity spans:
[Qualifier: Other] [Condition: active inflammatory process] ([Condition: major infection], [Condition: malignancy], [Condition: rheumatoid arthritis]/[Condition: autoimmune disorder]) [Temporal: within the prior 28 days].